Clinical trial inclusion criterion:
8. Persistent chronic clinically significant non-hematological toxicities from prior treatment must be ≤Grade 1.

Entity relations:
- multi("≤Grade 1", "≤Grade 1")
- Has_qualifier("toxicities", "≤Grade 1")
- Has_qualifier("toxicities", "non-hematological")
- Has_qualifier("toxicities", "clinically significant")
- Has_temporal("treatment", "prior")
- multi("from prior treatment", "treatment")
- Has_qualifier("toxicities", "from prior treatment")